Any new or definitely enlarging T2/FLAIR lesion or new gadolinium-enhancing lesion within the past three years (at least two scans separated by at least three years must be reviewed) on brain or spine MRI scan. Lesions must be 3mm or larger to be exclusionary.

The above is a clinical trial exclusion criterion. Annotated with entity spans:
Any new or definitely enlarging [Condition: T2/FLAIR lesion] or new [Qualifier: gadolinium-enhancing] [Condition: lesion] [Temporal: within the past three years] ([Multiplier: at least two] [Procedure: scans] [Temporal: separated by at least three years] must be reviewed) on [Procedure: brain] or [Procedure: spine MRI scan]. [Condition: Lesions] must be [Qualifier: 3mm or larger] to be exclusionary.